Massive hemoptysis defined as > 250 cc in a 24 hour period or 100 cc/day over 4 consecutive days occurring in the two weeks prior to Visit 2

The above is a clinical trial exclusion criterion. Annotated with entity spans:
[Qualifier: Massive] [Condition: hemoptysis] defined as [Multiplier: > 250 cc] [Temporal: in a 24 hour period] or [Multiplier: 100 cc/day] [Temporal: over 4 consecutive days] occurring [Temporal: in the two weeks prior to Visit 2]